Clinical trial exclusion criterion:
Severe hepatic dysfunction, defined as:

Annotated entities:
- Condition: "hepatic dysfunction"
- Qualifier: "Severe"